Clinical trial exclusion criterion:
psychiatric complaints that interfere with the correct use of the devices

Annotated entities:
- Condition: "psychiatric complaints"
- Observation: "correct use of the devices"
- Mood: "interfere with"